一位 66 歲女性長期患有慢性兩側膝關節疼痛，骨科檢查發現有一局部壓痛點在脛骨近端內側部位，恰位於縫匠肌（sartorius）遠端附著處。下列何者為最可能的診斷？
A. 膝蓋鵝掌狀韌帶滑囊炎（pes anserine bursitis）
B. 半月板破裂（meniscus tear）
C. 內側副韌帶扭傷（medial collateral ligament sprain）
D. 冠狀韌帶扭傷（coronary ligament sprain）

正確答案：A. 膝蓋鵝掌狀韌帶滑囊炎（pes anserine bursitis）